下列有關瘧原蟲之敘述中，何者正確？
A. 感染人類之瘧疾中，以卵形瘧（ovale malaria）的地理分布最廣
B. 臺灣近年有境外移入諾氏瘧原蟲（Plasmodium knowlesi）感染的病例
C. 間日瘧原蟲（Plasmodium vivax）喜侵入較成熟的紅血球，且受感染的紅血球會有脹大的現象
D. 惡性瘧（malignant tertian malaria）的復發（relapse）源自患者肝細胞中潛藏之休眠體（hypnozoites）

正確答案：B. 臺灣近年有境外移入諾氏瘧原蟲（Plasmodium knowlesi）感染的病例